Clinical trial exclusion criterion:
5. Primary sclerosing cholangitis

Annotated entities:
- Parsing_Error: "5."
- Condition: "Primary sclerosing cholangitis"